Clinical trial exclusion criterion:
HIV/ AIDS

Entity relations:
- Subsumes("HIV", "AIDS")